下列那一種維生素會增加週邊組織對於 levodopa 的代謝作用？
A. vitamine B6
B. vitamine B12
C. vitamine D
D. vitamine E

正確答案：A. vitamine B6